Participant and/or parent/legal guardian willing and able to give informed consent for participation in the study.

The above is a clinical trial inclusion criterion. Annotated with entity spans:
[Informed_consent: Participant and/or parent/legal guardian willing and able to give informed consent for participation in the study].